Clinical trial exclusion criterion:
History of any major internal disease (including diabetes, cardiovascular disease, lung disease, liver or kidney disease);

Annotated entities:
- Condition: "major internal disease"
- Condition: "diabetes"
- Condition: "cardiovascular disease"
- Condition: "lung disease"
- Condition: "kidney disease"
- Condition: "liver disease"